Con relación al proceso de valoración geriátrica, señale la respuesta correcta:
1. La escala de Reisberg se utiliza para la valoración mental de tipo afectivo.
2. La escala de Lawton y Brody se utiliza para la valoración social.
3. El test de Pfeiffer es una escala para la valoración cognitiva.
4. El índice de Katz es una escala para valorar la demencia.

Respuesta correcta: 3. El test de Pfeiffer es una escala para la valoración cognitiva.